Written informed consent

The above is a clinical trial inclusion criterion. Annotated with entity spans:
[Informed_consent: Written informed consent]